Clinical trial inclusion criterion:
Absence of hemodynamic collapse, or decompensation, at presentation; Hemodynamic collapse or decompensation

Entity relations:
- Has_negation("hemodynamic collapse", "Absence")
- OR("hemodynamic collapse", "hemodynamic decompensation")